當原核生物之DNA受到大量損害進行DNA修補時，須生產修補（repair）相關之蛋白質，此時下列何種蛋白質會被分解，以啟動修補蛋白質基因之轉錄？
A. RecA
B. LexA
C. UvrA
D. Lac repressor

正確答案：B. LexA